Clinical trial exclusion criterion:
Severe supine hypertension (Systolic Blood Pressure >180 or Diastolic Blood Pressure>110mmHg)

Annotated entities:
- Condition: "supine hypertension"
- Qualifier: "Severe"
- Measurement: "Systolic Blood Pressure"
- Measurement: "Diastolic Blood Pressure"
- Value: ">180"
- Value: ">110mmHg"